Clinical trial exclusion criterion:
current or regular use of psychiatric medications such as tranquilizers, antipsychotics, and/or antidepressants

Entity relations:
- Subsumes("psychiatric medications", "tranquilizers")
- OR("tranquilizers", "antipsychotics", "antidepressants")